Clinical trial exclusion criterion:
12. Current use of fibrates, including fenofibrates, or simvastatin

Entity relations:
- Has_temporal("fibrates", "Current")
- OR("fibrates", "fenofibrates", "simvastatin")